History of transjugular, intrahepatic, portosystemic shunt (TIPS) or vascular decompression surgery

The above is a clinical trial exclusion criterion. Annotated with entity spans:
[Temporal: History] of [Procedure: transjugular, intrahepatic, portosystemic shunt (TIPS)] or [Procedure: vascular decompression surgery]